Clinical trial exclusion criterion:
Current or recent (last 60 days) tobacco or nicotine use

Entity relations:
- Has_temporal("tobacco use", "last 60 days")
- OR("tobacco use", "nicotine use")